Evidence of pre-existing fetal anomalies incompatible with the child's life

The above is a clinical trial exclusion criterion. Annotated with entity spans:
Evidence of pre-existing [Condition: fetal anomalies] incompatible with the child's life